Clinical trial exclusion criterion:
Simultaneous participation in another intervention trial

Annotated entities:
- Context_Error: "Simultaneous participation in another intervention trial"
- Non-query-able: "Simultaneous participation in another intervention trial"